Which web-based pedigree editors are available?

Pedigreejs and Madeline 2.0 Pedigree Drawing Engine (PDE)